依據「醫療法」中說明病情的相關規定，下列敘述何者正確？
A. 說明病情須由具醫師身分者為之
B. 說明的對象僅限病人本人
C. 說明的內容包括病情、治療方針、處置、用藥、預後情形及可能之不良反應
D. 說明時須在病歷上記錄時間、地點、說明內容、說明的對象等

正確答案：C. 說明的內容包括病情、治療方針、處置、用藥、預後情形及可能之不良反應